Clinical trial inclusion criterion:
concomitant oral or i.v. therapy with strong CYP3A Inhibitors (e.g. ketoconazole, itraconazole, voriconazole, telithromycin, clarithromycin, nefazodone, ritonavir, saquinavir, nelfinavir, indinavir, atazanavir, grapefruit juice > 1 L/d), CYP3A substrates with narrow therapeutic indices (e.g. cyclosporine, quinidine), or strong CYP3A inducers (e.g. rifampin/rifampicin, phenytoin, carbamazepine, dexamethason, phenobarbital ) that cannot be safely discontinued

Annotated entities:
- Procedure: "oral therapy"
- Procedure: "i.v. therapy"
- Drug: "strong CYP3A Inhibitors"
- Drug: "ketoconazole"
- Drug: "itraconazole"
- Drug: "voriconazole"
- Drug: "telithromycin"
- Drug: "clarithromycin"
- Drug: "nefazodone"
- Drug: "ritonavir"
- Drug: "saquinavir"
- Drug: "nelfinavir"
- Drug: "indinavir"
- Drug: "atazanavir"
- Drug: "grapefruit juice"
- Multiplier: "> 1 L/d"
- Drug: "CYP3A substrates with narrow therapeutic indices"
- Drug: "cyclosporine"
- Drug: "quinidine"
- Drug: "strong CYP3A inducers"
- Drug: "rifampin"
- Drug: "rifampicin"
- Drug: "phenytoin"
- Drug: "carbamazepine"
- Drug: "dexamethason"
- Drug: "phenobarbital"